Clinical trial exclusion criterion:
Pregnant/breast-feeding women

Annotated entities:
- Condition: "Pregnant"
- Condition: "breast-feeding"
- Person: "women"